1. Institutionalized subjects will not be used. 2 Social Habits:

The above is a clinical trial exclusion criterion. Annotated with entity spans:
[Parsing_Error: 1.] [Non-query-able: Institutionalized subjects will not be used.] [Parsing_Error: 2 Social Habits:]